Clinical trial exclusion criterion:
Patients who are currently receiving treatment with any medications that have the potential to prolong the QT interval or inducing Torsade de Pointes and the treatment cannot be either safely discontinued at least one week prior to nilotinib treatment or switched to a different medication prior to start of nilotinib treatment and for the duration of the study

Entity relations:
- Has_temporal("treatment", "currently")
- Has_qualifier("any medications", "have the potential to prolong the QT interval")
- AND("treatment", "any medications")
- OR("have the potential to prolong the QT interval", "inducing Torsade de Pointes")